Clinical trial inclusion criterion:
Non-obese: defined as BMI less than 28 kg/m2

Entity relations:
- Has_negation("obese", "Non")
- Has_value("BMI", "less than 28 kg/m2")